Clinical trial inclusion criterion:
Biliary obstructive symptoms or signs

Entity relations:
- OR("Biliary obstructive symptoms", "Biliary obstructive signs")